History of significant head trauma, seizure disorder, or mental retardation

The above is a clinical trial exclusion criterion. Annotated with entity spans:
[Temporal: History] of significant [Condition: head trauma], [Condition: seizure disorder], or [Condition: mental retardation]